History of meningococcal diseases, confirmed either clinically, serologically, or microbiologically

The above is a clinical trial exclusion criterion. Annotated with entity spans:
History of [Condition: meningococcal diseases], [Value: confirmed] either clinically, [Procedure: serologically], or [Procedure: microbiologically]